Subject has unstable angina pectoris.

The above is a clinical trial exclusion criterion. Annotated with entity spans:
Subject has [Condition: unstable angina pectoris].